Antiemetic drug use in the 24 hours prior to cesarean delivery,

The above is a clinical trial exclusion criterion. Annotated with entity spans:
[Drug: Antiemetic drug] use [Temporal: in the 24 hours prior to cesarean delivery],